小腿骨折造成足踝無法背屈（dorsiflexion），下列何者最可能受傷？
A. 股神經
B. 腓神經
C. 脛神經
D. 坐骨神經

正確答案：B. 腓神經